En una entrevista, la enfermera como experta en comunicación eficaz debe evitar:
1. Tener alta reactividad, pues interrumpirá el discurso.
2. Los silencios, pues significa que no hay comunicación con el paciente.
3. Hacer preguntas de una en una, es mejor hacer varias a la vez.
4. Pedir clarificaciones a las expresiones vagas.
5. Usar facilitadores como “siga por favor”.

Respuesta correcta: 1. Tener alta reactividad, pues interrumpirá el discurso.